Substance or alcohol abuse.

The above is a clinical trial exclusion criterion. Annotated with entity spans:
[Condition: Substance] or [Condition: alcohol abuse].